¿Cuál de los siguientes antidiabéticos actúa inhibiendo la DPP-4 y prolongando la duración de las incretinas endógenas GLP-1 y GIP?:
1. Glimepirida.
2. Repaglinida.
3. Sitagliptina
4. Rosiglitazona.
5. Tolbutamida.

Respuesta correcta: 3. Sitagliptina